Clinical trial exclusion criterion:
Clinically relevant findings(e.g. blood pressure, electrocardiogram(ECG); physical and gynecological examination, laboratory examination)

Annotated entities:
- Measurement: "blood pressure"
- Procedure: "electrocardiogram(ECG)"
- Procedure: "gynecological examination"
- Procedure: "physical examination"
- Procedure: "laboratory examination"
- Qualifier: "Clinically relevant"
- Condition: "findings"
- Subjective_judgement: "Clinically relevant"
- Undefined_semantics: "Clinically relevant"